Clinical trial exclusion criterion:
Subject has clinically compromised vertebral bodies at the index level(s) due to any traumatic, neoplastic, metabolic, or infectious pathology.

Annotated entities:
- Condition: "clinically compromised vertebral bodies"
- Qualifier: "index level(s)"
- Condition: "infectious pathology"
- Condition: "metabolic pathology"
- Condition: "neoplastic pathology"
- Condition: "traumatic pathology"